What brain procedure can be done using the NeuroBlate system?

NeuroBlate System is used for Laser interstitial thermal therapy.